Contraindications to injecting Dotarem ®

The above is a clinical trial exclusion criterion. Annotated with entity spans:
[Condition: Contraindications] to injecting [Drug: Dotarem] ®